Clinical trial exclusion criterion:
Contraindication for baclofen or toxin

Annotated entities:
- Condition: "Contraindication"
- Drug: "baclofen"
- Drug: "toxin"